Clinical trial exclusion criterion:
Individuals with scalp shrapnel, cochlear implants, or aneurysm clips.

Annotated entities:
- Device: "scalp shrapnel"
- Device: "cochlear implants"
- Device: "aneurysm clips"